有關足癬（tinea pedis）的敘述，下列何者錯誤？
A. 可能在腳縫（toe webs）形成脫屑、糜爛
B. 可能在腳底造成角化、脫屑、龜裂
C. 可在腳底形成水疱，從病灶做 KOH examination，可能發現菌絲（hyphae）
D. 可能引起 id reaction，在手上形成丘疹和水疱，從 id reaction 的病灶做 KOH examination，可發現菌絲（hyphae）

正確答案：D. 可能引起 id reaction，在手上形成丘疹和水疱，從 id reaction 的病灶做 KOH examination，可發現菌絲（hyphae）